男性禿頭專用毛髮增生劑 finasteride 主要透過下列何種機轉來促進毛髮增生？
A. 為黃體素（progesterone）的衍生物，透過抑制雄激素（antiandrogenic）及抑制促性腺激素
B. 具有降低循環及前列腺內的二氫睪固酮（dihydrotestosterone）的產生，進而促進毛髮增生
C. 具有抑制芳香環轉化（aromatase）的活性，進而促進毛髮增生
D. 為一種合成的黃體素，透過活化黃體素受體來促進毛髮增生

正確答案：B. 具有降低循環及前列腺內的二氫睪固酮（dihydrotestosterone）的產生，進而促進毛髮增生